Clinical trial inclusion criterion:
2. Evidence on brain MRI of white matter hyperintensities (leukoaraiosis of moderate or severe degree according to the modified Fazekas visual scale and/or presence of lacunar infarcts).

Annotated entities:
- Procedure: "brain MRI"
- Observation: "white matter hyperintensities"
- Condition: "leukoaraiosis"
- Value: "moderate or severe degree"
- Measurement: "modified Fazekas visual scale"
- Condition: "lacunar infarcts"
- Parsing_Error: "2."